Clinical trial inclusion criterion:
patients with FEV1 / FVC <70%

Entity relations:
- Has_value("FEV1 / FVC", "<70%")